Clinical trial exclusion criterion:
Re-transplant;

Annotated entities:
- Procedure: "Re-transplant"